近年來發現分枝桿菌對異菸（isoniazid）、乙硫異菸胺（ethionamide）、乙胺丁酸（ethambutol）及環絲胺酸（cycloserine）等四種抗生素產生抗藥性日漸增多，下列何者為對上述藥物產生抗藥性之主要原因？
A. 菌體內有質體
B. 菌體發生改變使藥物無法進入
C. 菌體分泌酵素使藥物分解
D. 菌體改變對此類藥物之代謝途徑

正確答案：B. 菌體發生改變使藥物無法進入